Clinical trial inclusion criterion:
6. For females of reproductive potential, use of at least one barrier contraceptive and a second effective birth control method during the study and for at least two weeks after the last dose. For male subjects, use of appropriate contraception (e.g., condoms), so their female partners of reproductive potential do not become pregnant during the study and for at least two weeks after the last dose

Annotated entities:
- Parsing_Error: "6."
- Condition: "reproductive potential"
- Person: "females"
- Multiplier: "at least one"
- Device: "barrier contraceptive"
- Qualifier: "second"
- Device: "birth control method"
- Qualifier: "effective"
- Subjective_judgement: "effective"
- Temporal: "during the study"
- Temporal: "for at least two weeks after the last dose"
- Reference_point: "the last dose"
- Person: "male"
- Device: "contraception"
- Device: "condoms"
- Qualifier: "appropriate"
- Subjective_judgement: "appropriate"
- Person: "female"
- Condition: "reproductive potential"
- Condition: "pregnant"
- Negation: "not become"
- Temporal: "during the study"
- Temporal: "for at least two weeks after the last dose"
- Reference_point: "the last dose"
- Post-eligibility: "For male subjects, use of appropriate contraception (e.g., condoms), so their female partners of reproductive potential do not become pregnant during the study and for at least two weeks after the last dose"
- Non-query-able: "For male subjects, use of appropriate contraception (e.g., condoms), so their female partners of reproductive potential do not become pregnant during the study and for at least two weeks after the last dose"